Which cellular function is associated with transcription factors forkhead 1 and 2 (Fkh1 and Fkh2)?

Forkhead transcription factors establish origin timing and long-range clustering in S. cerevisiae. Here we show that the yeast Forkhead transcription factors, Fkh1 and Fkh2, are global determinants of replication origin timing.